Clinical trial exclusion criterion:
8. Allergy or hypersensitivity to metformin hydrochloride. 9. History of difficulty in swallowing medication, or any gastrointestinal disorder which could affect the drug absorption.

Annotated entities:
- Parsing_Error: "8."
- Drug: "metformin hydrochloride"
- Condition: "hypersensitivity"
- Condition: "Allergy"
- Parsing_Error: "9."
- Condition: "difficulty in swallowing medication"
- Temporal: "History"
- Condition: "gastrointestinal disorder"
- Qualifier: "affect the drug absorption"
- Subjective_judgement: "affect the drug absorption"